神經學檢查中有關之神經反射，何者屬於單突觸反射（monosynaptic reflex）？
A. 瞳孔反射（pupillary light reflex）
B. 回縮反射（withdrawal reflex）
C. 膝腱反射（knee jerk）
D. 交叉伸肌反射（crossed-extensor reflex）

正確答案：C. 膝腱反射（knee jerk）